Clinical trial inclusion criterion:
8. Is able to read, speak, and understand English.

Annotated entities:
- Parsing_Error: "8."
- Non-query-able: "Is able to read, speak, and understand English."